Clinical trial inclusion criterion:
Cardiovascular disease:

Annotated entities:
- Parsing_Error: "Cardiovascular disease:"